Glucocorticosteroid injection to the diseased achilles tendon within the last 6 months.

The above is a clinical trial exclusion criterion. Annotated with entity spans:
[Drug: Glucocorticosteroid] [Procedure: injection] to the [Condition: diseased achilles tendon] [Temporal: within the last 6 months].